Severe renal insufficiency (Creatinine Clearance < 30 ml/min).

The above is a clinical trial exclusion criterion. Annotated with entity spans:
[Qualifier: Severe] [Condition: renal insufficiency] ([Measurement: Creatinine Clearance] [Value: < 30 ml/min]).